Clinical trial exclusion criterion:
Patients scheduled to undergo revision total knee arthroplasty for infectious reasons.

Annotated entities:
- Procedure: "revision total knee arthroplasty"
- Condition: "infectious reasons"